Clinical trial exclusion criterion:
Scheduled cardiac resynchronization therapy or heart transplantation.

Annotated entities:
- Procedure: "cardiac resynchronization therapy"
- Procedure: "heart transplantation"